聚合酶鏈鎖反應（PCR）所使用之 Taq polymerase 與大腸桿菌 DNA 複製（DNA replication）兩者所使用的 DNA 聚合酶主要差異性為何？
A. 熱穩定性（thermal stability）
B. 聚合酶活性
C. 3'核酸外切酶（3'exonuclease）活性
D. 反應時，對二價金屬離子的需求

正確答案：A. 熱穩定性（thermal stability）